Cuando una persona está afectada por un suceso mayor estresante o muchos sucesos menores estresantes diarios, su organismo puede reaccionar mostrándose en los órganos diana por acción del:
1. Eje neural autónomo produciendo efectos prolongados.
2. Eje neural periférico produciendo efectos intermedios.
3. Eje neuroendocrino estimulando la médula adrenal y produciendo efectos inmediatos.
4. Hipotálamo.
5. Eje endocrino sobre la médula espinal.

Respuesta correcta: 4. Hipotálamo.